下列那種細胞類型的外陰癌（Vulva cancer）最常見？
A. 黑色素瘤（Melanoma）
B. 基底細胞（Basal cell）
C. 鱗狀細胞（Squamous cell）
D. 肉瘤（Sarcoma）

正確答案：C. 鱗狀細胞（Squamous cell）